一位 81 歲女性病人因上腹部疼痛及高燒 1 天由急診住院。她有糖尿病、高血壓及心臟病病史。急診時體溫為 39℃、血壓 170/68 mmHg、脈搏 86/min、呼吸率 24/min。身體檢查發現肝臟腫大且在右側下胸廓有 knocking pain。抽血檢查白血球 13,300/µL，其中帶狀（band）白血球 34%、分節（segment）白血球 49%，血紅素 12.6 g/dL、血小板 38,000/µL。AST 154 IU/L、ALT 124 IU/L、全膽紅素（total bilirubin）
 6 mg/dL。尿液檢查正常。胸部 X 光檢查無肺炎的變化。下列檢查中那一項應優先安排？
A. 腹部 X 光（KUB）
B. 核子醫學掃描
C. 腹部磁振造影
D. 腹部超音波檢查

正確答案：D. 腹部超音波檢查